一位 60 歲的男性在健康體檢時發現血清前列腺特定抗原（PSA）濃度為 28.51 ng/mL，尿液檢查正常，肛門指檢結果發現前列腺肥大，表面不規則，但無硬結，亦無壓痛。則下列何者為較佳之處置？
A. 服用甲型阻斷劑（α-blocker）
B. 服用 5α-還原酶抑制劑（5α-reductase inhibitor）
C. 使用抗生素
D. 接受經直腸超音波檢查，以及前列腺穿刺切片

正確答案：D. 接受經直腸超音波檢查，以及前列腺穿刺切片